Trisomy 13（Patau syndrome）不會合併下列何種異常？
A. 唇顎裂（cleft lip/palate）
B. 臍膨出（omphalocele）
C. 大頭畸形（macrocephaly）
D. 橈骨發育不良（radial bone aplasia）

正確答案：C. 大頭畸形（macrocephaly）